Clinical trial inclusion criterion:
plus 2 of 4:

Annotated entities:
- Multiplier: "2 of 4"
- Non-representable: "plus 2 of 4:"
- Parsing_Error: "plus 2 of 4:"